Clinical trial exclusion criterion:
Person is under 18 years of age.

Entity relations:
- Has_value("age", "under 18 years")